Hypersensitivity or allergy to one of the study drugs

The above is a clinical trial inclusion criterion. Annotated with entity spans:
[Condition: Hypersensitivity] or [Condition: allergy] to one of the [Drug: study drugs]